Clinical trial exclusion criterion:
Uncontrolled diabetes mellitus

Entity relations:
- Has_qualifier("diabetes mellitus", "Uncontrolled")